子宮陰道部（portio vaginalis uteri）或子宮外伸部（ectocervix）的上皮組織是：
A. 單層柱狀上皮
B. 複層扁平上皮
C. 複層柱狀上皮
D. 偽複層柱狀上皮

正確答案：B. 複層扁平上皮